關於缺鐵性貧血（iron-deficiency anemia）的敘述， 下列何者錯誤？
A. 易發生於9至24個月大的兒童
B. 青春期的女生，常因經血量太多而引起
C. 因為身體內的鐵不夠，每個紅血球會被盡量公平的分配到一樣的鐵，使得紅血球分布寬度 （red cell distribution width）減少
D. 發生缺鐵性貧血時，血清鐵（serum iron） 的量會減少，總鐵結合能力（total iron binding capacity）會增加

正確答案：C. 因為身體內的鐵不夠，每個紅血球會被盡量公平的分配到一樣的鐵，使得紅血球分布寬度 （red cell distribution width）減少